下列何組織具有腦砂（brain sand）？
A. 腎上腺
B. 甲狀腺
C. 腦下垂體
D. 松果腺

正確答案：D. 松果腺